Causa de la sífilis:
1. Trichomonas vaginalis.
2. Neisseria gonorrhoeae.
3. Treponema pallidum.
4. Mycoplasma genitalium.
5. Mobiluncus curtisii.

Respuesta correcta: 3. Treponema pallidum.